La fermentación de la glucosa que emplea Escherichia coli es la:
1. Láctica.
2. Propiónica.
3. Alcohólica.
4. Butírica.
5. Ácido-mixta.

Respuesta correcta: 5. Ácido-mixta.